你為六個月大的小明作預防接種，根據接種紀錄小明已依規定時程接受過兩劑 B 型肝炎疫苗、兩劑 DPT（白喉、百日咳及破傷風）疫苗及兩劑小兒麻痺口服疫苗。這次需為小明接種那些疫苗才是最完整的？
A. DPT 疫苗及小兒麻痺口服疫苗
B. DPT 疫苗及 MMR（麻疹、腮腺炎及德國麻疹）疫苗
C. B 型肝炎疫苗、DPT 疫苗、小兒麻痺口服疫苗
D. B 型肝炎疫苗、DPT 疫苗、小兒麻痺口服疫苗、MMR 疫苗

正確答案：C. B 型肝炎疫苗、DPT 疫苗、小兒麻痺口服疫苗